Clinical trial exclusion criterion:
Significant hepatic impairment (Serum GPT > 120 U/L).

Entity relations:
- Has_qualifier("hepatic impairment", "Significant")